Clinical trial exclusion criterion:
Acute or infectious inflammatory disease

Entity relations:
- Has_qualifier("inflammatory disease", "Acute")
- OR("Acute", "infectious")